Stage 3 - 5 Chronic Kidney Disease

The above is a clinical trial inclusion criterion. Annotated with entity spans:
[Measurement: Stage] [Value: 3 - 5] [Condition: Chronic Kidney Disease]